下列有關腹腔鏡手術之敘述，何者錯誤？
A. 腹腔鏡手術以全身麻醉進行為佳
B. 對後腹膜腔的器官或需要從腹膜外（extraperitoneal space）進入腹腔時，有時需要用氣球撐開術（balloon dissection） 來打開第一個洞
C. 腹腔外的內視鏡手術（extraperitoneal endosurgery）可做手術的空間較小，且會增加腸沾粘的機會
D. 以手輔助的腹腔鏡手術（hand-assisted laparoscopic surgery）被認為可以降低外科醫師轉換到腹腔鏡的學習曲線，也可減少改為傳統手術的機會

正確答案：C. 腹腔外的內視鏡手術（extraperitoneal endosurgery）可做手術的空間較小，且會增加腸沾粘的機會